Clinical trial inclusion criterion:
Male subjects (whether surgically sterilized or not) with female partners of child-bearing potential must use two forms of contraception, one of which must be a barrier method, for the duration of the study and for 77 days after the last dose

Entity relations:
- Has_negation("surgically sterilized", "not")
- AND("Male", "female")
- AND("female", "child-bearing potential")
- Has_multiplier("forms of contraception", "two")
- Subsumes("forms of contraception", "barrier method")
- Has_index("for the duration of the study", "the study")
- Has_index("for 77 days after the last dose", "the last dose")
- Has_temporal("forms of contraception", "for the duration of the study")
- Has_temporal("forms of contraception", "for 77 days after the last dose")
- OR("surgically sterilized", "surgically sterilized")